Clinical trial exclusion criterion:
Significant leucopenia, neutropenia, thrombocytopenia, anemia, or known bleeding diathesis

Entity relations:
- Has_qualifier("leucopenia", "Significant")
- OR("leucopenia", "neutropenia", "thrombocytopenia", "anemia", "bleeding diathesis")